Clinical trial inclusion criterion:
Patient fasting for at least 6 hours.

Annotated entities:
- Observation: "fasting"
- Temporal: "for at least 6 hours."